下列何種檢查，不能用來測試雙眼立體視覺？
A. Titmus fly test with polaroid glasses
B. worth 4-dot test with red-green glasses
C. firsby test（without spectacles）
D. 大弱視鏡（major amblyoscope）例如：synoptophore

正確答案：B. worth 4-dot test with red-green glasses